Clinical trial exclusion criterion:
Patients who received corticosteroids in the last 6 weeks.

Entity relations:
- Has_temporal("corticosteroids", "in the last 6 weeks")